What can we measure with the TSA-Seq method?

TSA-Seq, a new mapping method capable of providing a "cytological ruler" for estimating mean chromosomal distances from nuclear speckles genome-wide and for predicting several Mbp chromosome trajectories between nuclear compartments without sophisticated computational modeling. Mapping 3D genome organization relative to nuclear compartments using TSA-Seq as a cytological ruler.